Clinical trial exclusion criterion:
Body Mass Index =39.9 kg/m2

Annotated entities:
- Measurement: "Body Mass Index"
- Value: "=39.9 kg/m2"